Prior treatment with any anti-TNF agent

The above is a clinical trial exclusion criterion. Annotated with entity spans:
[Temporal: Prior] [Procedure: treatment] with any [Drug: anti-TNF agent]